Clinical trial exclusion criterion:
5. Recent initiation (<8 weeks from Screening) or planned initiation of cardiopulmonary rehabilitation exercise program.

Entity relations:
- Has_index("<8 weeks from Screening", "Screening")
- Subsumes("Recent", "<8 weeks from Screening")
- Has_temporal("cardiopulmonary rehabilitation exercise program", "Recent")
- OR("Recent", "planned")